Treatment with rifaximin or neomycin in the previous 7 days.

The above is a clinical trial exclusion criterion. Annotated with entity spans:
Treatment with [Drug: rifaximin] or [Drug: neomycin] [Temporal: in the previous 7 days].